Clinical trial exclusion criterion:
Prior treatment with any anti-TNF agent

Annotated entities:
- Drug: "anti-TNF agent"
- Procedure: "treatment"
- Temporal: "Prior"